下列各項有關西尼羅病毒感染（West Nile virus infection）之敘述，何者最不適當？
A. 鳥類是主要的傳染媒介（vector）
B. 大部分受感染者為無症狀的感染
C. 其嚴重併發症為腦炎及腦膜炎之神經侵襲性疾病表現
D. 偶會合併嚴重致死性肝炎

正確答案：A. 鳥類是主要的傳染媒介（vector）